Treatment with any therapeutically dosed anticoagulant for more than 48 hours prior to enrolment

The above is a clinical trial exclusion criterion. Annotated with entity spans:
Treatment with any [Qualifier: therapeutically] dosed [Drug: anticoagulant] for [Temporal: more than 48 hours prior to enrolment]